Subjects who can't comply with the appointments or with every protocol requirement.

The above is a clinical trial exclusion criterion. Annotated with entity spans:
[Non-query-able: Subjects who can't comply with the appointments or with every protocol requirement.]